有關不同類型（isotype）免疫球蛋白在人體內分布的情形，下列敘述何者正確？
A. 血清中含量最高的是 IgA
B. 腸胃道黏膜中含量最高的為 IgE
C. 體組織液中有高含量的 IgG
D. IgM 可以穿過胎盤，保護胎兒

正確答案：C. 體組織液中有高含量的 IgG